10. Willing to refrain from use of vaginal products or objects within 14 days prior to enrollment and for the duration of the study

The above is a clinical trial inclusion criterion. Annotated with entity spans:
10. [Mood: Willing] to [Negation: refrain] from use of [Drug: vaginal products] or [Drug: objects] [Temporal: within 14 days prior to enrollment] and [Temporal: for the duration of the study]